Where is the the protein perforin localized?

Perforin are stored inside the leukocytes in secretory granules.